下列有關良性前列腺肥大（BPH） 的敘述，何者錯誤？
A. BPH是源自前列腺之transition zone（TZ）
B. 顯微鏡下BPH係由stroma及上皮細胞所組成，而stroma中之平滑肌則是由α-1交感神經所支配為主
C. BPH的體積大小與血液中之free testosterone及estrogen均成正相關
D. BPH所引起的下泌尿道阻塞症狀與肛門指診時其體積大小成正相關

正確答案：D. BPH所引起的下泌尿道阻塞症狀與肛門指診時其體積大小成正相關